Clinical trial exclusion criteria:
prior allergic reaction to interferon products, congestive heart failure, elevated liver enzymes

Annotated entities:
- Temporal: "prior"
- Condition: "allergic reaction"
- Drug: "interferon products"
- Condition: "congestive heart failure"
- Condition: "elevated liver enzymes"